實驗室檢查 DIC（Disseminated intravascular coagulation）病人，不會發現下列何種血液檢查結果？
A. 不正常的 PT（Prothrombin time）
B. 不正常的 aPTT（Activated partial thromboplastin time）
C. Fibrin degradation products 減少
D. D-dimer 增加

正確答案：C. Fibrin degradation products 減少